Clinical trial inclusion criterion:
Patients must have adequate renal function as documented by a calculated creatinine clearance ≥ 60.

Annotated entities:
- Measurement: "renal function"
- Value: "adequate"
- Measurement: "calculated creatinine clearance"
- Value: "≥ 60"